¿Qué función tienen los indicadores basados en “sucesos centinela”?:
1. Detectar sucesos con resultados graves, indeseables y, a menudo, evitables.
2. Detectar pequeñas incidencias, que indican que un procedimiento no se está aplicando adecuadamente.
3. Sistemas de alarmas, que recuerdan a los Servicios y Unidades la realización inminente de una auditoría de calidad.
4. Indicadores económico-financieros, que avisan que hay partidas presupuestarias de gastos, que se ha utilizado por encima del 90%.
5. Identificar sucesos, aparentemente de escasa importancia, pero que por su reiteración pueden requerir un mayor control.

Respuesta correcta: 1. Detectar sucesos con resultados graves, indeseables y, a menudo, evitables.